在平滑肌收縮過程中，Ca2+與下列何者結合後才能促使cross-bridge cycling進行，並啟動收縮？
A. actin
B. myosin
C. troponin
D. calmodulin

正確答案：D. calmodulin